下列關於肺結核病（pulmonary TB）的手術適應症與敘述，何者錯誤？
A. 最常見的適應症為多重抗藥性肺結核
B. 併發黴菌感染或大咳血時應考慮手術
C. 病人術前的白蛋白值最好高於 3 g/dL
D. 因為病人術前通常身體虛弱，手術應該全都以胸腔鏡手術進行

正確答案：D. 因為病人術前通常身體虛弱，手術應該全都以胸腔鏡手術進行